Clinical trial inclusion criterion:
7) HRSD question #9 regarding suicide <2,

Entity relations:
- Has_value("HRSD question #9", "<2")